Clinical trial exclusion criterion:
9. Severe arthritis or other problems that limit passive range of motion;

Entity relations:
- OR("Severe arthritis", "problems that limit passive range of motion")